1. Patients with other uncontrolled infections (see 2.3.2 for definitions)

The above is a clinical trial exclusion criterion. Annotated with entity spans:
[Parsing_Error: 1.] Patients with [Condition: other uncontrolled infections] (see 2.3.2 for definitions)